Clinical trial exclusion criteria:
Patients who have coma, convulsion or paralysis due to intracranial hemorrhage or central nervous system leukemia at diagnosis.

Annotated entities:
- Condition: "coma"
- Condition: "convulsion"
- Condition: "paralysis"
- Condition: "intracranial hemorrhage"
- Qualifier: "central nervous system"
- Condition: "leukemia"
- Temporal: "at diagnosis"